Clinical trial inclusion criterion:
Elective Female Pelvic Medicine and Reconstructive Surgery or Gynecologic Minimally Invasive surgeries including hysterectomy, suburethral sling, and pelvic organ prolapse repair that require cystoscopy.

Entity relations:
- Has_qualifier("Medicine", "Female Pelvic")
- Has_qualifier("Medicine", "Elective")
- Has_qualifier("surgeries", "Minimally Invasive")
- Has_qualifier("surgeries", "Gynecologic")
- Has_mood("cystoscopy", "require")
- AND("surgeries", "cystoscopy")
- OR("Medicine", "Reconstructive Surgery")
- OR("surgeries", "hysterectomy", "pelvic organ prolapse repair", "suburethral sling")
- OR("Medicine", "surgeries")